Clinical trial exclusion criterion:
Previous uterine surgery.

Annotated entities:
- Procedure: "uterine surgery"
- Temporal: "Previous"